下列有關局部性麻醉劑（local anesthetics）藥理作用之敘述，何者錯誤？
A. 局部麻醉劑一般為弱酸性物質
B. 局部麻醉劑通常作用在鈉離子管道產生其藥理作用
C. 局部麻醉劑在正常生理的 pH 值（7.4）為陽離子形式
D. 全身性投與局部麻醉劑時容易發生中樞神經抑制作用

正確答案：A. 局部麻醉劑一般為弱酸性物質